有關 T 細胞上的 CD4 與 CD8 分子的敘述，何者最正確？
A. CD4 的結構是由 2 條不同胜肽鏈所構成
B. 這 2 種分子都可以直接結合抗原蛋白片段
C. 這 2 種分子均可與組織相容性複合體（MHC）分子相結合
D. CD4 及 CD8 分子皆沒有參與 T 細胞的活化訊號傳遞系統

正確答案：C. 這 2 種分子均可與組織相容性複合體（MHC）分子相結合